Clinical trial exclusion criterion:
Inadequate bone marrow reserve

Annotated entities:
- Condition: "Inadequate bone marrow reserve"